Available to participate for the study duration, including all planned follow-up visits for up to 9 months from screening.

The above is a clinical trial inclusion criterion. Annotated with entity spans:
[Post-eligibility: Available to participate for the study duration, including all planned follow-up visits for up to 9 months from screening.]